有關上縱隔（superior mediastinum）內，神經走向之敘述，下列何者正確？
A. 右喉返神經（right reccurent laryngeal nerve）繞經右頭臂靜脈（right brachiocephalic vein）向上
B. 左喉返神經（left reccurent laryngeal nerve）繞經左鎖骨下動脈（left subclavian artery）向上
C. 右膈神經位於上腔靜脈（superior vena cava）和縱膈肋膜（mediastinal part of parietal pleura）間
D. 左膈神經沿降主動脈（descendig aorta）下行

正確答案：C. 右膈神經位於上腔靜脈（superior vena cava）和縱膈肋膜（mediastinal part of parietal pleura）間